What does the gene symbol EREG stand for?

The gene symbol EREG stands for the gene epiregulin.